Exclusions Based on Laboratory Values

The above is a clinical trial exclusion criterion. Annotated with entity spans:
[Parsing_Error: Exclusions Based on Laboratory Values]